下列有關 Lyme arthritis 的敘述，何者正確？
A. 類固醇為首選治療藥物
B. 通常對口服 doxycycline 的治療無效
C. 由 Borrelia burgdorferi 感染所引起
D. 以侵犯手指或腳趾的小關節為主

正確答案：C. 由 Borrelia burgdorferi 感染所引起